Previous or concurrent malignancy, except for adequately treated basal cell or squamous cell skin cancer, in situ cervical cancer, or any other cancer for which the patient has been previously treated and the lifetime recurrence risk is less than 30%

The above is a clinical trial exclusion criterion. Annotated with entity spans:
[Qualifier: Previous] or [Qualifier: concurrent] [Condition: malignancy], [Negation: except] for [Qualifier: adequately treated] [Condition: basal cell] or [Condition: squamous cell skin cancer], [Qualifier: in situ] [Condition: cervical cancer], or [Non-query-able: any other cancer for which the patient has been previously treated and the lifetime recurrence risk is less than 30%]